Un aumento de ACTH estimula la síntesis y liberación de:
1. Aldosterona.
2. Cortisol.
3. Tiroxina.
4. CRH.
5. TRH.

Respuesta correcta: 2. Cortisol.